Clinical trial inclusion criterion:
Patients with end-stage renal disease(ESRD)/chronic kidney disease(CKD)stage 5

Annotated entities:
- Condition: "end-stage renal disease"
- Condition: "ESRD"
- Condition: "chronic kidney disease"
- Condition: "CKD"
- Qualifier: "stage 5"